55歲男性被診斷出攝護腺腫大和血中攝護腺特有抗原（prostate specific antigen）上升，核磁共振檢查顯示在下腹部有許多擴大的淋巴結，X光照射發現骨盆有兩個蝕骨性的病變。下列何者較適合被用來治療攝護腺腫瘤？
A. oxandrolone
B. desogestrel
C. anastrozole
D. flutamide

正確答案：D. flutamide